What is the association of epigallocatechin with the cardiovascular system?

Epigallocatechin gallate (EGCG), a bioactive ingredient of green tea, plays a protective role in the cardiovascular system.